Systolic blood pressure> 90 mmHg

The above is a clinical trial inclusion criterion. Annotated with entity spans:
[Measurement: Systolic blood pressure][Value: > 90 mmHg]